Clinical trial exclusion criterion:
9. Relevant electrocardiograph abnormalities; bradycardia (50 bpm) or tachycardia (120 bpm) under resting conditions.

Annotated entities:
- Parsing_Error: "9."
- Condition: "abnormalities"
- Procedure: "electrocardiograph"
- Condition: "bradycardia"
- Measurement: "50 bpm"
- Condition: "tachycardia"
- Measurement: "120 bpm"
- Qualifier: "under resting conditions"
- Qualifier: "Relevant"
- Undefined_semantics: "Relevant"